Clinical trial exclusion criterion:
Patients on chronic (longer than the prior 6 months) anticoagulation other than with antiplatelet medications;

Entity relations:
- Has_negation("antiplatelet", "other than")
- Has_temporal("anticoagulation", "longer than the prior 6 months")